Clinical trial inclusion criterion:
the last vaccination intervals = 14 days and the last attenuated live vaccine intervals = 28 days

Entity relations:
- Has_value("last attenuated live vaccine intervals", "= 28 days")
- Has_value("last vaccination intervals", "= 14 days")